Clinical trial exclusion criterion:
Body mass index (BMI) > 34

Annotated entities:
- Measurement: "Body mass index"
- Measurement: "BMI"
- Value: "> 34"